Severe daytime sleepiness, defined as Epworth Sleepiness Scale score 18 or higher or a report of falling asleep driving during the previous year, and deemed a safety risk by study physician

The above is a clinical trial exclusion criterion. Annotated with entity spans:
Severe [Condition: daytime sleepiness], defined as [Measurement: Epworth Sleepiness Scale] [Value: score 18 or higher] or [Non-query-able: a report of falling asleep driving during the previous year, and deemed a safety risk by study physician]